Known upper gastrointestinal malignancy

The above is a clinical trial exclusion criterion. Annotated with entity spans:
Known [Condition: upper gastrointestinal malignancy]